Clinical trial exclusion criterion:
Having cancer or have received treatment for cancer within three years (persons with a history of cancer who are disease-free without treatment for three years or more are eligible), excluding minor skin cancers, which are allowed unless located at the vaccination site

Entity relations:
- AND("treatment for cancer", "cancer")
- Has_temporal("cancer", "within three years")
- Has_negation("treatment", "without")
- AND("cancer", "treatment")
- Has_temporal("cancer", "history")
- AND("cancer", "disease-free")
- OR("cancer", "treatment for cancer")
- OR("cancer", "cancer")